Hematologic malignancies.

The above is a clinical trial exclusion criterion. Annotated with entity spans:
[Condition: Hematologic malignancies].